What is the most common monogenic cause of common variable immunodeficiency (CVID) in Europeans?

Loss-of-function nuclear factor κB subunit 1 (NFKB1) variants are the most common monogenic cause of common variable immunodeficiency in Europeans.